Inability to speak English

The above is a clinical trial exclusion criterion. Annotated with entity spans:
[Non-query-able: Inability to speak English]